Clinical trial inclusion criteria:
age over 40
composite head and neck tumor resection
treated hypertension
hypertension medications taken on morning of surgery (except diuretics)

Annotated entities:
- Person: "age"
- Value: "over 40"
- Procedure: "composite head and neck tumor resection"
- Condition: "hypertension"
- Qualifier: "treated"
- Drug: "hypertension medications"
- Temporal: "on morning of surgery"
- Drug: "diuretics"
- Negation: "except"